肺膨脹不全（atelectasis）最少見於：
A. 氣道阻塞
B. 肋膜腔積水
C. 肺泡表面張力素不足
D. 急性肺炎

正確答案：D. 急性肺炎